一位路倒病人被救護車送到急診室時發現眼睛僅對痛有反應，會發出嗯嗯啊啊的呻吟，四肢呈現不正常的彎曲（abnormal flexion），病人的昏迷指數（Glasgow coma scale）是幾分？
A. 6
B. 7
C. 8
D. 9

正確答案：B. 7